關於老人照護的原則，下列何者正確？
A. 強調疾病之治癒
B. 以維持功能及維持自我照顧能力為原則
C. 老年人的照護，僅需治療性的診治
D. 老年人新出現的疾病，不會造成其功能進一步退化

正確答案：B. 以維持功能及維持自我照顧能力為原則